La mutación del gen BRCA-1 se asocia con alto riesgo de:
1. Infarto agudo de miocardio.
2. Cáncer de mama.
3. Enfermedad de Alzheimer.
4. Enfermedad de Parkinson.
5. Enfermedad de Tay-Sach.

Respuesta correcta: 2. Cáncer de mama.